Patients give informed consent prior to participating in this study.

The above is a clinical trial inclusion criterion. Annotated with entity spans:
[Informed_consent: Patients give informed consent prior to participating in this study].